最常引起嬰兒病毒性胃腸炎之 RNA 病毒為：
A. 腺病毒（Adenoviruses）40 及 41 型
B. A 型輪狀病毒（Rotavirus A）
C. EB 病毒（Epstein-Barr Virus）
D. 鼻病毒（Rhinovirus）

正確答案：B. A 型輪狀病毒（Rotavirus A）